Clinical trial inclusion criterion:
Age 18-100 years

Annotated entities:
- Person: "Age"
- Value: "18-100 years"